Clinical trial exclusion criterion:
Allergy in dexmedethomidine and opioid

Entity relations:
- AND("Allergy", "dexmedethomidine")
- OR("dexmedethomidine", "opioid")